What is the reason for the narcolepsy cases developed after H1N1 influenza vaccination?

The proposed mechanism for postvaccination narcolepsy is one in which an environmental trigger causes or enhances an antibody-mediated autoimmune response in patients with a preexisting genetic susceptibility.